Previous exposure to cytotoxic drugs or pelvic irradiation.

The above is a clinical trial exclusion criterion. Annotated with entity spans:
Previous [Condition: exposure] to [Drug: cytotoxic drugs] or [Procedure: pelvic irradiation].